Participants who are decisionally and/or cognitively impaired

The above is a clinical trial exclusion criterion. Annotated with entity spans:
Participants who are decisionally and/or [Condition: cognitively impaired]